Clinical trial exclusion criterion:
have HIV infection

Annotated entities:
- Condition: "HIV infection"